What is situs inversus?

Situs inversus totalis is a rare congenital anomaly with a complete mirror image of the thoracic and abdominal organs.